Clinical trial exclusion criterion:
Concomitant treatment with any other anticancer therapy.

Annotated entities:
- Temporal: "Concomitant"
- Procedure: "treatment"
- Qualifier: "any other"
- Procedure: "anticancer therapy"